Clinical trial exclusion criterion:
Dementia

Annotated entities:
- Condition: "Dementia"